cardiac disease

The above is a clinical trial exclusion criterion. Annotated with entity spans:
[Condition: cardiac disease]